Subjects who are incarcerated or wards of the state

The above is a clinical trial exclusion criterion. Annotated with entity spans:
[Non-representable: Subjects who are incarcerated or wards of the state]